醫療臨床上常常會有「善意的謊言」，善意的謊言違反了生命倫理四原則的那一個原則？
A. 尊重自主原則
B. 行善原則
C. 不傷害原則
D. 正義原則

正確答案：A. 尊重自主原則